Clinical trial exclusion criterion:
History of clinical typhoid fever, clinical paratyphoid A or B fever.

Entity relations:
- Has_temporal("clinical typhoid fever", "History")
- OR("clinical typhoid fever", "clinical paratyphoid B fever", "clinical paratyphoid A fever")